有關眼瞼腫瘤的治療，下列何者是最可靠且最有效的方法？
A. 內科治療
B. 手術治療
C. 放射療法
D. 定期觀察

正確答案：B. 手術治療